Clinical trial exclusion criterion:
Hypersensitivity to vitamin K

Entity relations:
- AND("Hypersensitivity", "vitamin K")